Clinical trial exclusion criterion:
Has a diagnosed additional malignancy within 3 years prior to first dose of study medication with the exception of curatively treated basal cell carcinoma of the skin, squamous cell carcinoma of the skin and/or curatively resected in situ cancers

Entity relations:
- Has_qualifier("malignancy", "additional")
- Has_qualifier("treated", "curatively")
- Has_qualifier("resected", "curatively")
- Has_qualifier("basal cell carcinoma of the skin", "curatively treated")
- Has_qualifier("in situ cancers", "curatively resected")
- Has_index("within 3 years prior to first dose of study medication", "first dose of study medication")
- Has_temporal("malignancy", "within 3 years prior to first dose of study medication")
- Has_negation("treated", "with the exception of")
- AND("malignancy", "treated")
- Has_negation("basal cell carcinoma of the skin", "with the exception of")
- Has_negation("resected", "with the exception of")
- AND("malignancy", "basal cell carcinoma of the skin")
- AND("malignancy", "resected")
- OR("basal cell carcinoma of the skin", "squamous cell carcinoma of the skin", "in situ cancers")